Known hypersensitivity to pembrolizumab or another mAb.

The above is a clinical trial exclusion criterion. Annotated with entity spans:
Known [Condition: hypersensitivity to pembrolizumab] or another [Drug: mAb].